Metastatic disease to the breast.

The above is a clinical trial exclusion criterion. Annotated with entity spans:
[Condition: Metastatic disease] [Qualifier: to the breast].